一位 55 歲男性，在急診接受顯影劑注射的電腦斷層後，突然出現呼吸急促，全身熱潮紅，合併意識改變的情形，血壓 65/30 mmHg，應優先選擇下列何者處置？
A. 靜脈注射抗組織胺（Antihistamine）
B. 靜脈注射類固醇（Steroid）
C. 靜脈注射腎上腺素（Epinephrine）
D. 吸入性支氣管擴張劑（Bronchodilator）

正確答案：C. 靜脈注射腎上腺素（Epinephrine）